Clinical trial inclusion criterion:
Subjects undergoing elective total knee or hip replacement or a revision of at least one component of a total knee or hip replacement

Annotated entities:
- Qualifier: "elective"
- Procedure: "total knee replacement"
- Procedure: "total hip replacement"
- Procedure: "a total knee replacement revision of"
- Qualifier: "at least one component"
- Procedure: "a hip replacement revision of"
- Temporal: "undergoing"